What is nephropathic cystinosis?

Cystinosis is an autosomal recessive lysosomal storage disorder. It is caused by mutations in the CTNS gene, which encodes the cystinosin protein. In cases of cystinoin deficiency, free cystine accumulates in lyssomes and forms toxic crystals.